Clinical trial exclusion criterion:
Severe Arrhythmia including atrial fibrillation, atrial flutter, ventricular fibrillation, ventricular flutter or ventricular tachycardia.

Annotated entities:
- Condition: "Arrhythmia"
- Qualifier: "Severe"
- Condition: "atrial fibrillation"
- Condition: "atrial flutter"
- Condition: "ventricular fibrillation"
- Condition: "ventricular flutter"
- Condition: "ventricular tachycardia"